Age = 17.

The above is a clinical trial exclusion criterion. Annotated with entity spans:
[Person: Age] [Value: = 17].